Clinical trial exclusion criterion:
Baseline LIC >30 mg/g dw (measured by MRI);

Annotated entities:
- Measurement: "LIC"
- Value: ">30 mg/g"
- Temporal: "Baseline"
- Procedure: "MRI"
- Mood: "measured by"